一位 45 歲家庭主婦，無明顯受傷病史，主訴近三個月來經常左肩疼痛。左上臂外展（abduction）時疼痛會加重，睡覺時壓迫更是劇痛難以入眠。身體診查發現：左肩外展肌力下降，但屈曲（anterior flexion）被動關節活動度正常。X 光檢查：左肩有一直徑約 1 公分之白色斑塊。此病患最可能診斷為下列何者？
A. 黏連性關節囊炎（adhesive capsulitis）
B. 旋轉肌肌腱撕裂傷（rotator cuff tear）
C. 棘上肌鈣化性肌腱炎（calcified supraspinatus tendinitis）
D. 肱二頭肌肌腱炎（bicipital tendinitis）

正確答案：C. 棘上肌鈣化性肌腱炎（calcified supraspinatus tendinitis）